List the major families of Histones.

Five histone families (H1, H2A, H2B, H3, and H4).